慢性積液性中耳炎治療多久無效，且聽力損失大於 15 分貝，可考慮施行中耳導氣管置放術？
A. 2 週
B. 1 個月
C. 6 週
D. 3 個月

正確答案：D. 3 個月